En la rama ascendente gruesa del asa de Henle:
1. Se reabsorbe agua.
2. Se diluye el líquido tubular.
3. La reabsorción de agua depende de ADH.
4. La reabsorción de urea depende de ADH.
5. La aldosterona estimula la reabsorción de Na+.

Respuesta correcta: 2. Se diluye el líquido tubular.